Clinical trial inclusion criterion:
Signed consent form

Annotated entities:
- Informed_consent: "Signed consent form"